4. Received an investigational drug in the 30 days prior to the screening for this study

The above is a clinical trial exclusion criterion. Annotated with entity spans:
[Parsing_Error: 4.] Received an [Drug: investigational drug] [Temporal: in the 30 days prior to the screening] for this study